Clinical trial exclusion criterion:
Subject has an active systemic infection.

Entity relations:
- Has_qualifier("systemic infection", "active")